下列副甲狀腺疾病，最常造成原發性副甲狀腺機能亢進（primary hyperparathyroidism）的病變是：
A. 腺瘤
B. 增生
C. 腺癌
D. 發炎

正確答案：A. 腺瘤